Clinical trial exclusion criterion:
Prior or current use of any CCR5 antagonist (such as MVC and cenicriviroc [CVC]) and integrase inhibitor (such as RAL, DTG, and elvitegravir [EVG])

Annotated entities:
- Temporal: "Prior"
- Temporal: "current"
- Drug: "CCR5 antagonist"
- Drug: "MVC"
- Drug: "cenicriviroc [CVC]"
- Drug: "integrase inhibitor"
- Drug: "RAL"
- Drug: "DTG"
- Drug: "elvitegravir [EVG]"